What are the 4 cardinal signs of inflammation according to Celsus?

Tumor, calor, rubor, and dolor describe four cardinal signs of inflammation.